Clinical trial exclusion criterion:
Current/recent upper respiratory infection (within four weeks prior to the surgery)

Entity relations:
- multi("the surgery", "surgery")
- Has_index("within four weeks prior to the surgery", "the surgery")
- Has_temporal("upper respiratory infection", "Current")
- Subsumes("Current", "within four weeks prior to the surgery")
- OR("Current", "recent")